Clinical trial exclusion criterion:
Creatinine > 1.5 mg/dL

Annotated entities:
- Measurement: "Creatinine"
- Value: "> 1.5 mg/dL"